Clinical trial inclusion criterion:
Male and females aged 18 to 70 years

Entity relations:
- Has_value("aged", "18 to 70 years")